Clinical trial exclusion criterion:
other drugs that interact with 3HP (see Table 1)

Annotated entities:
- Non-query-able: "other drugs that interact with 3HP (see Table 1)"